Serum creatinine level >120 umol/ml for men and >105 umol/ml for women at screening.

The above is a clinical trial exclusion criterion. Annotated with entity spans:
[Measurement: Serum creatinine level] [Value: >120 umol/ml] for [Person: men] and [Value: >105 umol/ml] for [Person: women] [Temporal: at screening].